Mental Retardation or Autistic Spectrum Disorder

The above is a clinical trial exclusion criterion. Annotated with entity spans:
[Condition: Mental Retardation] or [Condition: Autistic Spectrum Disorder]